Clinical trial inclusion criterion:
1. Are referred to the Cachexia Clinic with involuntary weight loss of >5% of their premorbid weight within the previous 6 months.

Entity relations:
- Has_value("involuntary weight loss", ">5% of their premorbid weight")
- Has_temporal("involuntary weight loss", "within the previous 6 months")